Clinical trial exclusion criterion:
Present therapy with systemic steroids

Entity relations:
- Has_temporal("therapy", "Present")
- AND("therapy", "systemic steroids")